Clinical trial exclusion criterion:
Variceal bleeding in the last 90 days

Entity relations:
- Has_temporal("Variceal bleeding", "in the last 90 days")